一位 45 歲男性肝硬化患者，有大量腹水。醫師在限鹽無效後，考慮給予利尿劑。考量是肝硬化所引起之 hyperaldosteronism，你認為以下何者是最佳選擇？
A. spironolactone
B. hydrochlorothiazide
C. furosemide
D. acetazolamide

正確答案：A. spironolactone